下列何者不是新生兒胎便吸入症候群（meconium aspiration syndrome）之常見 X 光片表現？
A. 兩肺有粗顆粒或斑片狀陰影
B. 胸廓前後徑增加
C. 橫膈膜變平
D. 肋膜腔積液

正確答案：D. 肋膜腔積液